Clinical trial exclusion criterion:
WBC <3 K/cumm

Entity relations:
- Has_value("WBC", "<3 K/cumm")